1. Antibiotics: clarithromycin, erythromycin, telithromycin, nafcillin, rifampin

The above is a clinical trial exclusion criterion. Annotated with entity spans:
[Parsing_Error: 1.] Antibiotics: [Drug: clarithromycin], [Drug: erythromycin], [Drug: telithromycin], [Drug: nafcillin], [Drug: rifampin]